臨床上，常給予子癎前症的患者硫酸鎂（MgSO4）來預防抽搐（seizure attack）。此時血液中最適當的鎂離子治療濃度為多少 meq/L？
A. 2～3.9 meq/L
B. 4～7 meq/L
C. 7.1～10 meq/L
D. 大於 10 meq/L

正確答案：B. 4～7 meq/L